Clinical trial exclusion criterion:
7. History of significant urogenital or uterine prolapse, undiagnosed vaginal bleeding, urethral obstruction

Entity relations:
- Has_qualifier("vaginal bleeding", "undiagnosed")
- Has_qualifier("urogenital prolapse", "significant")
- Has_temporal("urogenital prolapse", "History")
- OR("urogenital prolapse", "uterine prolapse")
- OR("urogenital prolapse", "vaginal bleeding", "urethral obstruction")